Patients with a clinical diagnosis of depression who in the judgement of their physician require medication management may be eligible for enrollment. A score of 10 or more on the PHQ-9 instrument will be required for enrollment.

The above is a clinical trial inclusion criterion. Annotated with entity spans:
Patients with a clinical diagnosis of [Condition: depression] who in the judgement of their physician require [Drug: medication] management may be eligible for enrollment. A [Value: score of 10 or more] on the [Measurement: PHQ-9] instrument will be required for enrollment.